El proceso de granulación de un polvo:
1. Produce la disminución de la densidad aparente de la mezcla de polvo, por lo que se garantiza la introducción en la matriz del volumen de polvo requerido.
2. Se justifica porque se mejora el deslizamiento del polvo para garantizar que los comprimidos tengan una variación de peso aceptable.
3. Conduce a la cohesión de polvos y a la formación de aglomerados mediante exclusivamente fuerzas electrostáticas.
4. Por vía húmeda consiste en adicionar una pequeña cantidad de líquido, con una distribución posterior en dos estados, capilar y funicular.

Respuesta correcta: 2. Se justifica porque se mejora el deslizamiento del polvo para garantizar que los comprimidos tengan una variación de peso aceptable.